下列何者易感染紅血球的前期細胞而造成貧血，或感染孕婦而造成死胎？
A. parvovirus B19
B. JC virus
C. BK virus
D. cytomegalovirus

正確答案：A. parvovirus B19